Clinical trial exclusion criterion:
(9)Participation in a clinical trial for a drug that has not yet been officially approved for marketing within one month prior to the first visit.

Annotated entities:
- Observation: "Participation in a clinical trial"
- Drug: "drug that has not yet been officially approved for marketing"
- Temporal: "within one month prior to the first visit"
- Reference_point: "the first visit"